Clinical trial inclusion criterion:
Optical coherence tomography central subfield thickness of at least 250 microns

Annotated entities:
- Measurement: "Optical coherence tomography central subfield thickness"
- Value: "at least 250 microns"